Clinical trial inclusion criterion:
Experience with pump-assisted infusions of IgPro20 at the tolerated flow rate of 25 mL/h per injection site for at least 1 month prior to Day 1.

Annotated entities:
- Qualifier: "pump-assisted infusions"
- Drug: "IgPro20"
- Multiplier: "flow rate of 25 mL/h per injection site"
- Qualifier: "tolerated"
- Temporal: "for at least 1 month prior to Day 1"
- Reference_point: "Day 1"